Had an unsatisfactory response to a previous adequate trial of quetiapine as judged by a study investigator.

The above is a clinical trial exclusion criterion. Annotated with entity spans:
[Non-query-able: Had an unsatisfactory response to a previous adequate trial of quetiapine as judged by a study investigator].